Clinical trial exclusion criterion:
Common Variable Immune Deficiency (CVID)

Annotated entities:
- Condition: "Common Variable Immune Deficiency (CVID)"